Hepatitis C recurrence defined by the presence of abnormal liver function test, positive HCV-RNA, histological signs of hepatitis C recurrence.

The above is a clinical trial inclusion criterion. Annotated with entity spans:
[Condition: Hepatitis C] [Multiplier: recurrence] defined by the presence of [Value: abnormal] [Measurement: liver function test], [Value: positive] [Measurement: HCV-RNA], [Condition: histological signs of hepatitis C recurrence].